Known allergy or hypersensitive reaction to dexmedetomidine

The above is a clinical trial exclusion criterion. Annotated with entity spans:
Known [Condition: allergy] or [Condition: hypersensitive] reaction to [Drug: dexmedetomidine]